Which type of pluripotency is Otx2 associated with?

Otx2 is required to maintain the ESC metastable state by antagonizing ground state pluripotency and promoting commitment to differentiation. Furthermore, Otx2 is required for ESC transition into EpiSCs and, subsequently, to stabilize the EpiSC state by suppressing, in pluripotent cells, the mesendoderm-to-neural fate switch in cooperation with BMP4 and Fgf2. Otx2 is a novel intrinsic determinant controlling the functional integrity of ESCs and EpiSCs. Otx2 and Oct4 drive early enhancer activation during embryonic stem cell transition from naive pluripotency.